Patients of child-bearing potential should be using adequate contraceptive measures should not be breast feeding and must have a negative pregnancy test prior to start of dosing

The above is a clinical trial inclusion criterion. Annotated with entity spans:
Patients of [Observation: child-bearing potential] should be using [Procedure: adequate contraceptive measures] should [Negation: not be] [Condition: breast feeding] and must have a [Value: negative] [Measurement: pregnancy test] [Temporal: prior to start of dosing]